La estrategia de investigación en psicoterapia consistente en comparar todos los componentes de un tratamiento con otro en el que se elimina uno de los componentes de dicho tratamiento, se conoce como:
1. Diseño de caso único.
2. Desmantelamiento.
3. Estudio de proceso.
4. Estandarización de tratamientos.
5. Diseño placebo.

Respuesta correcta: 2. Desmantelamiento.